Clinical trial inclusion criteria:
DSM-IV or DSM-5 diagnosis of schizophrenia or schizoaffective disorder
Male or Female
Age: 18 to 65 years
Caucasian or Non-Caucasian
Smoke at least 10 cigarettes daily
Urine cotinine level ? 100 ng/ml (NicAlert(r) reading ? 3)
Agrees to wear a head mounted display (HMD) for up to 45 minutes
Able to complete the Evaluation to Sign Consent (ESC) with minimum score of 80%

Annotated entities:
- Qualifier: "DSM-IV"
- Qualifier: "DSM-5"
- Condition: "schizophrenia"
- Condition: "schizoaffective disorder"
- Person: "Male"
- Person: "Female"
- Person: "Age"
- Value: "18 to 65 years"
- Person: "Caucasian"
- Person: "Non-Caucasian"
- Observation: "Smoke"
- Value: "at least 10 cigarettes daily"
- Measurement: "Urine cotinine level"
- Value: "? 100 ng/ml"
- Measurement: "NicAlert(r)"
- Value: "? 3"
- Observation: "Agrees to wear"
- Device: "head mounted display (HMD)"
- Temporal: "for up to 45 minutes"
- Observation: "Able to complete"
- Procedure: "Evaluation to Sign Consent (ESC)"
- Value: "minimum score of 80%"